下列何者是已被確認的致畸胎藥物？
A. natural progesterone
B. warfarin
C. salicylates
D. cephalosporins

正確答案：B. warfarin